Age ≥ 18 years old

The above is a clinical trial inclusion criterion. Annotated with entity spans:
[Person: Age] [Value: ≥ 18 years old]